一位32歲男性因發燒無力有一星期之久求診，血液常規顯示白血球計數達96,000/µL, 芽球 0 gm/dL, platelet 15,000/µL。骨髓檢查報告為acute lymphoblastic leukemia。費城染色體陽性。經誘導化學治療及tyrosine kinase inhibitor（TKI）達到完全緩解，以下何者會有最高的根治機會？
A. 鞏固治療＋維持治療
B. 鞏固治療＋骨髓摧毀性化學治療併自體造血幹細胞移植
C. 鞏固治療＋骨髓摧毀性化學治療併人類白血球抗原（HLA）吻合之異體造血幹細胞移植
D. 鞏固治療＋anti-CD-5, CD-20, CD-22雞尾酒免疫治療

正確答案：C. 鞏固治療＋骨髓摧毀性化學治療併人類白血球抗原（HLA）吻合之異體造血幹細胞移植